Clinical trial exclusion criterion:
major anesthetic risk factors or history of previous problem with anesthesia

Annotated entities:
- Condition: "anesthetic risk factors"
- Qualifier: "major"
- Condition: "problem with anesthesia"
- Temporal: "previous"